Which gene mutations are predictive of response to anti-TNF therapy in Rheumatoid Arthritis patients?

Μutations in TLR5 and TLR1 genes contribute to differential response to anti-TNF treatment in RA. Variation at FCGR2A and functionally related genes such as DHX32 and RGS12 is also associated with the response to anti-TNF therapy in rheumatoid arthritis.